uncontrolled diabetes,

The above is a clinical trial exclusion criterion. Annotated with entity spans:
[Qualifier: uncontrolled] [Condition: diabetes],